下列何者由橫隔（septum transversum）發育形成？
A. 原始縱膈（primitive mediastinum）
B. 肋橫膈隱窩（costodiaphragmatic recess）
C. 橫膈膜周邊部分（peripheral portion of diaphragm）
D. 橫膈膜中央腱（central tendon of diaphragm）

正確答案：D. 橫膈膜中央腱（central tendon of diaphragm）